5. Known allergies to: aspirin, clopidogrel (Plavix) and ticlopidine (Ticlid), heparin, bivalirudin, stainless steel, or contrast agent (which cannot be adequately premedicated).

The above is a clinical trial exclusion criterion. Annotated with entity spans:
5. Known [Condition: allergies] to: [Drug: aspirin], [Drug: clopidogrel] ([Drug: Plavix]) and [Drug: ticlopidine] ([Drug: Ticlid]), [Drug: heparin], [Drug: bivalirudin], [Observation: stainless steel], or [Drug: contrast agent] (which cannot be adequately premedicated).